Clinical trial inclusion criterion:
obese : weight for height > median + 3 standard deviations

Annotated entities:
- Condition: "obese"
- Measurement: "weight for height"
- Value: "> median + 3 standard deviations"